Clinical trial exclusion criterion:
Has had a chest x-ray within 2 months prior to Screening that shows an abnormality suggestive of a current active infection or malignancy

Entity relations:
- Has_qualifier("infection", "active")
- Has_temporal("infection", "current")
- Has_mood("infection", "suggestive")
- AND("abnormality", "infection")
- Has_temporal("chest x-ray", "within 2 months prior to Screening")
- AND("chest x-ray", "abnormality")
- Has_index("within 2 months prior to Screening", "Screening")
- OR("infection", "malignancy")